Cuando tenemos a nuestro cuidado un paciente terminal, la vía de elección para la administración de los fármacos, siempre que sea posible será:
1. Subcutánea.
2. Oral.
3. Inhalatoria.
4. Intravenosa.

Respuesta correcta: 2. Oral.